Clinical trial inclusion criterion:
Age >= 18

Entity relations:
- Has_value("Age", ">= 18")